Clinical trial inclusion criterion:
Patients with PN during their hospitalization

Entity relations:
- multi("their hospitalization", "hospitalization")
- Has_index("during their hospitalization", "their hospitalization")
- Has_temporal("PN", "during their hospitalization")